Type 2 diabetes (HbA1c>6.5) or type 1 diabetes

The above is a clinical trial exclusion criterion. Annotated with entity spans:
[Condition: Type 2 diabetes] ([Measurement: HbA1c][Value: >6.5]) or [Condition: type 1 diabetes]